New York Heart Association (NYHA) class of II - IV

The above is a clinical trial inclusion criterion. Annotated with entity spans:
[Measurement: New York Heart Association] ([Measurement: NYHA]) class of [Value: II - IV]